Documented history of type 2 diabetes mellitus.

The above is a clinical trial inclusion criterion. Annotated with entity spans:
Documented history of [Condition: type 2 diabetes mellitus].